一位 12 歲小女生，有鐮刀型貧血病史，入院時發高燒、敗血症、右側大腿紅腫熱痛，X 光檢查發現股骨近端有明顯的骨髓炎，最有可能的病原菌為何？
A. Enterobacter cloacae
B. Proteus mirabilis
C. Pseudomonas aeruginosa
D. Salmonella enteritidis

正確答案：D. Salmonella enteritidis